胃的惡性腫瘤中，約有15%為惡性淋巴癌，即原發性胃淋巴瘤（primary gastric lymphoma）。以下相關的敘述中，何者正確？
A. 胃鏡檢查下胃惡性淋巴瘤和胃腺癌可清楚辨別，不需切片病理診斷
B. 絕大多數的原發性胃淋巴瘤為T-細胞淋巴瘤
C. 若為mucosa-associated lymphoid tissue（MALT）淋巴瘤，應考慮使用抗生素治療清除H. pylori
D. 若為high-grade、large-cell淋巴瘤，均應進行胃腫瘤及次全胃切除手術，再考慮化療，以避免發生腫瘤出血、阻塞或穿孔等合併症

正確答案：C. 若為mucosa-associated lymphoid tissue（MALT）淋巴瘤，應考慮使用抗生素治療清除H. pylori